Clinical trial exclusion criterion:
Coronary or carotid artery disease likely to require surgical or percutaneous intervention within the 6 months.

Annotated entities:
- Condition: "carotid artery disease"
- Condition: "Coronary artery disease"
- Procedure: "surgical intervention"
- Mood: "likely"
- Procedure: "percutaneous intervention"
- Temporal: "within the 6 months"